Clinical trial exclusion criteria:
Prior trombosis or myocardial infarction, congenital coagulation disorder, use of anti-coagulants prior to surgery, prior thoracic surgery, pregnancy, pre-operative fibrinogen concentration <1g/L

Annotated entities:
- Condition: "trombosis"
- Temporal: "Prior"
- Condition: "myocardial infarction"
- Condition: "congenital coagulation disorder"
- Drug: "anti-coagulants"
- Temporal: "prior to surgery"
- Temporal: "prior"
- Procedure: "thoracic surgery"
- Condition: "pregnancy"
- Temporal: "pre-operative"
- Measurement: "fibrinogen concentration"
- Value: "<1g/L"